Clinical trial exclusion criterion:
Serum ferritin level < 20 ng/mL at screening.

Entity relations:
- Has_value("Serum ferritin", "< 20 ng/mL")